Clinical trial exclusion criterion:
Suspect or certainty of fetal malformation,

Annotated entities:
- Condition: "fetal malformation"
- Mood: "certainty"
- Mood: "Suspect"